Clinical trial exclusion criterion:
Uncontrolled Diabetes (Hemoglobin A1C > 7.5)

Entity relations:
- Has_value("Hemoglobin A1C", "> 7.5")
- Has_qualifier("Diabetes", "Uncontrolled")
- Subsumes("Diabetes", "Hemoglobin A1C")